關於妊娠滋養細胞疾病（gestational trophoblastic disease-GTD；gestational trophoblastic tumor-GTT；gestational trophoblastic neoplasm-GTN）， 下列何者敘述婦癌醫師較有一致的看法？
A. GTT或GTN中要依手術病理之期別後，開始化學治療
B. 轉移到肺部為第三期，治療後之緩解率將近50%
C. 均對單劑化學藥物的治療有反應
D. 葡萄胎（complete hydatidiform mole）比部分葡萄胎（partial hydatidiform mole）少見

正確答案：D. 葡萄胎（complete hydatidiform mole）比部分葡萄胎（partial hydatidiform mole）少見